Clinical trial inclusion criterion:
For patients of reproductive potential (males and females), use of reliable means for contraception (e.g., contraceptive pill, intrauterine device [IUD], physical barrier) throughout the trial and for 1 year following their final exposure to study treatment

Annotated entities:
- Condition: "reproductive potential"
- Procedure: "contraception"
- Drug: "contraceptive pill"
- Device: "intrauterine device [IUD]"
- Device: "physical barrier"
- Temporal: "throughout the trial"
- Temporal: "for 1 year following their final exposure"